Which deiodinase is known to be present in liver?

High D1 and D3 activities are present in fetal human liver, and high D1 and mostly absent D3 activities are present in adult human liver.